45歲女性主訴右腳無力兩天，神經學檢查發現右下肢無力，肚臍以下左側痛、溫覺喪失，檢查顯示為發炎性脊髓病變，對於她的檢查結果之敘述，下列何者錯誤？
A. 磁振造影呈現病灶處T1訊號上升（T1-weighted hyperintense）、T2訊號不變（T2-weighted isointense），則可能為急性脊髓炎
B. 視神經檢查可幫助診斷視神經脊髓炎
C. 腰椎穿刺結果可能發現細胞-蛋白分離（cytoalbuminologic dissociation）
D. 血液檢查可能出現anti-SSA antibody

正確答案：A. 磁振造影呈現病灶處T1訊號上升（T1-weighted hyperintense）、T2訊號不變（T2-weighted isointense），則可能為急性脊髓炎